Clinical trial exclusion criterion:
Known positive status for HIV, active hepatitis B or hepatitis C

Entity relations:
- Has_temporal("hepatitis B", "active")
- Has_temporal("hepatitis C", "active")
- OR("HIV", "hepatitis B", "hepatitis C")